Clinical trial exclusion criterion:
2. Suspected or known digestive tract obstruction, stricture, or perforation

Entity relations:
- OR("digestive tract obstruction", "digestive tract perforation", "digestive tract stricture")